Clinical laboratory values as specified in the study protocol

The above is a clinical trial inclusion criterion. Annotated with entity spans:
[Non-query-able: Clinical laboratory values as specified in the study protocol]